Age 3 to 18 years on day of surgery

The above is a clinical trial inclusion criterion. Annotated with entity spans:
[Person: Age] [Value: 3 to 18 years] [Temporal: on day of surgery]